Women with POI: For the purpose of the research women is considered to have POI if she is aged less than 40 years and has amenorrhea of at least 4 month with FSH level above 25 IU/L (repeated twice >4 weeks apart).

The above is a clinical trial inclusion criterion. Annotated with entity spans:
[Person: Women] with [Condition: POI]: For the purpose of the research women is considered to have POI if she is [Person: aged] [Value: less than 40 years] and has [Condition: amenorrhea] of [Temporal: at least 4 month] with [Measurement: FSH level] [Value: above 25 IU/L] ([Multiplier: repeated twice] [Temporal: >4 weeks apart]).